¿Cuál es la respuesta FALSA en relación a los estilos de vida saludables?:
1. Los estilos de vida son patrones colectivos de conducta.
2. Están basados en elecciones realizadas sobre opciones disponibles.
3. Es una actividad emprendida por un individuo con objeto de mantener la salud.
4. Están determinados por su estatus, edad, género y etnia entre otros factores.

Respuesta correcta: 3. Es una actividad emprendida por un individuo con objeto de mantener la salud.